Clinical trial inclusion criterion:
Male and female subjects aged 9 to 17 months on the day of inclusion

Entity relations:
- Has_index("on the day of inclusion", "the day of inclusion")
- Has_value("aged", "9 to 17 months")
- Has_temporal("aged", "on the day of inclusion")
- OR("Male", "female")